Vaginal bleeding.

The above is a clinical trial exclusion criterion. Annotated with entity spans:
[Condition: Vaginal bleeding].